Clinical trial exclusion criterion:
Severe Dehydration

Annotated entities:
- Qualifier: "Severe"
- Condition: "Dehydration"